位於膽囊與圓韌帶裂隙（fissure for ligamentum teres）間的是肝臟的那個部分？
A. 左葉
B. 右葉
C. 方形葉（quadrate lobe）
D. 尾葉（caudate lobe）

正確答案：C. 方形葉（quadrate lobe）